對於嚴重之 asthma 可以使用 MDI 的 combination therapy，下列何種 combination 最為適當？
A. short-acting β-agonist＋anti-cholinergics
B. long-acting β-agonist＋anti-cholinergics
C. short-acting β-agonist＋corticosteroids
D. long-acting β-agonist＋corticosteroids

正確答案：D. long-acting β-agonist＋corticosteroids